Patients must have a pre-treatment granulocyte count (i.e., segmented neutrophils + bands) of greater than or equal to 1,500/mm3, a hemoglobin level of greater than or equal to 9 gm/dl, and platelet count greater than or equal to 50,000/mm3. The granulocyte requirement may be waived if in the investigator's opinion the lower count reflects hypersplenism with adequate bone marrow reserves.

The above is a clinical trial inclusion criterion. Annotated with entity spans:
Patients must have a [Temporal: pre-treatment] [Measurement: granulocyte count] (i.e., [Measurement: segmented neutrophils + bands]) of [Value: greater than or equal to 1,500/mm3], a [Measurement: hemoglobin level] of [Value: greater than or equal to 9 gm/dl], and [Measurement: platelet count] [Value: greater than or equal to 50,000/mm3]. The granulocyte requirement may be waived if in the investigator's opinion the lower count reflects hypersplenism with adequate bone marrow reserves.